Caracteriza a la RNA polimerasa en la transcripción
1. Sintetizar DNA empleando RNA como molde.
2. Iniciar la síntesis del RNA sin necesidad de cebadores.
3. Llevar a cabo la síntesis simultánea de dos cadenas de RNA.
4. Transcribir todo el DNA a RNA.

Respuesta correcta: 2. Iniciar la síntesis del RNA sin necesidad de cebadores.